Clinical trial inclusion criterion:
Signed Informed Consent Form

Annotated entities:
- Post-eligibility: "Signed Informed Consent Form"